Clinical trial exclusion criterion:
Known allergy/sensitivity or any hypersensitivity to components of study drugs (ART) or their formulations

Annotated entities:
- Condition: "allergy"
- Condition: "sensitivity"
- Condition: "hypersensitivity"
- Drug: "components of study drugs"
- Drug: "ART"
- Drug: "or their formulations"